Which is the most common editing modification in eukaryotic mRNA?

One of the most common forms of pre-mRNA editing is A-to-I editing, in which adenosine is deaminated to inosine, which is read as guanosine during translation.